Una aleación Au-Ag:
1. Es intersticial, y puede darse en cualquier composición.
2. Es sustitucional, y puede darse en cualquier composición.
3. El oro y la plata no pueden alearse.
4. Puede disolverse una pequeña cantidad de oro en la plata, hasta un límite cercano al 10%, pero no en mayor proporción.
5. Puede disolverse una pequeña cantidad de plata en el oro, hasta un límite cercano al 10%, pero no en mayor proporción.

Respuesta correcta: 2. Es sustitucional, y puede darse en cualquier composición.